Clinical trial exclusion criterion:
Participants currently receiving any type of anticoagulation or blood thinning medications, including heparin, low molecular weight heparins, Plavix, aspirin, NSAIDS

Entity relations:
- Subsumes("anticoagulation", "heparin")
- OR("anticoagulation", "blood thinning medications")
- OR("heparin", "low molecular weight heparins", "Plavix", "aspirin", "NSAIDS")